Clinical trial inclusion criterion:
With hot flashes and with or without active sexual life.

Annotated entities:
- Condition: "hot flashes"
- Observation: "without active sexual life"
- Observation: "with active sexual life"